Clinical trial exclusion criterion:
History or presence of clinically significant drug sensitivity or clinically significant allergic reaction to corticosteroids or salmeterol.

Annotated entities:
- Condition: "drug sensitivity"
- Condition: "allergic reaction"
- Drug: "corticosteroids"
- Drug: "salmeterol"